Age <18 years old

The above is a clinical trial exclusion criterion. Annotated with entity spans:
[Person: Age] [Value: <18 years old]